陰囊（scrotum）皮膚的惡性黑色素細胞瘤（malignant melanoma）最可能先轉移至下列那個淋巴結？
A. 髂內淋巴結（internal iliac lymph nodes）
B. 髂外淋巴結（external iliac lymph nodes）
C. 腹股溝淺淋巴結（superficial inguinal lymph nodes）
D. 主動脈淋巴結（aortic lymph nodes）

正確答案：C. 腹股溝淺淋巴結（superficial inguinal lymph nodes）